抗癲癇藥物在患者的血液中達到穩定濃度（steady state concentrations）的時間通常是此藥物半衰期的幾倍？
A. 二
B. 三
C. 四
D. 五

正確答案：D. 五